Hombre de 47 años de edad que consulta por edemas en miembros inferiores de 3 semanas de evolución. En la analítica sanguínea presenta creatinina 1.3 mg/dL, colesterol total 270 mg/dL y albúmina 2.4 g/dL. En el sedimento de orina presenta 15-20 hematíes por campo y en orina de 24 horas se detecta proteinuria 3.7 g/día. ¿Cuál es el diagnóstico más probable?
1. Enfermedad de cambios mínimos.
2. Glomerulosclerosis focal y segmentaria.
3. Nefropatía membranosa.
4. Glomerulonefritis      membranoproliferativa tipo I.
5. Glomerulonefritis proliferativa mesangial.

Respuesta correcta: 3. Nefropatía membranosa.